Lower left ventricular ejection fraction 45% (LVEF <45%) assessed by simple and recent echocardiogram;

The above is a clinical trial inclusion criterion. Annotated with entity spans:
[Measurement: Lower left ventricular ejection fraction] [Value: 45%] ([Measurement: LVEF] [Value: <45%]) assessed by simple and [Temporal: recent] [Procedure: echocardiogram];